Clinical trial exclusion criterion:
Medical history of cardiovascular disease, malignant cancer, diabetes or kidney disease

Entity relations:
- OR("cardiovascular disease", "kidney disease", "malignant cancer", "diabetes")